La lanzadera de la carnitina al interior de la mitocondria, transporta:
1. Poder reductor.
2. ATP y Pi.
3. Ácidos grasos.
4. Aminoácidos proteicos.

Respuesta correcta: 3. Ácidos grasos.